pregnancy or lactating women

The above is a clinical trial exclusion criterion. Annotated with entity spans:
[Condition: pregnancy] or [Condition: lactating] [Person: women]